最有效處理麻痺性腸阻塞的方法為何？
A. 使用 Cisapride
B. 使用 Neostigmine
C. 使用 Erythromycin
D. 給予大量水分補充，鼻胃管引流，改善敗血症及代謝性或電解質異常

正確答案：D. 給予大量水分補充，鼻胃管引流，改善敗血症及代謝性或電解質異常